What is the pyroptotic pathway?

Pyroptosis is an inflammasome-mediated programmed cell death pathway.